List biomarkers for sepsis.

HCK, PRKCD, SIRPA, DOK3, ITGAM, LTB4R, MAPK14, MALT1, NLRC3, LCK
C-Reactive Protein (CRP), Procalcitonin (PCT) and Interleukin 6 (IL-6)
sTM